7. Unable to give informed consent

The above is a clinical trial exclusion criterion. Annotated with entity spans:
[Parsing_Error: 7.] Unable to give [Observation: informed consent]